Clinical trial exclusion criterion:
History of keratitis, ulcerative keratitis or severe dry eye.

Annotated entities:
- Condition: "keratitis"
- Condition: "ulcerative keratitis"
- Qualifier: "severe"
- Condition: "dry eye"